Clinical trial inclusion criterion:
1) histologically confirmed (patients not receiving a single sputum cytology diagnosis) non-small cell lung cancer patients,with wild-type EGFR and ALK-negative; 2) According to IASLC2009 new TNM staging of lung cancer stage <U+2162>B or <U+2163>, previously untreated or relapsed after 1 year of lung cancer resection; 3) have at least one evaluable lesions,according to version 1.1 of the standard in accordance with a judgment RECIST(longest diameter on a spiral CT at least 10mm,on a regular CT longest diameter at least 20mm); 4) Male or female, aged 18 to 75 years; 5) ECOG PS 0 or 1; 6) expected survival at least 3 months; 7) adequate hematological function: absolute neutrophil count (ANC) at least 2×10^9/L and platelet count at least 100×10^9/L and hemoglobin at least 9 g/dL; 8) adequate liver function: total bilirubin less than upper limit of normal (ULN); AST and ALT less than 2.5 times upper limit of normal (ULN); alkaline phosphatase less than 5 times the upper limit of normal (ULN); 9) adequate renal function: serum creatinine less than upper limit of normal (ULN) or calculated creatinine clearance at least 60 mL/min; 10) ECG is normal, there is no non-healing wounds on the body; 11) had not received previous treatment anticancer drugs, or had only received for previous non-metastatic tumors adjuvant or neoadjuvant chemotherapy, but when you start to study treatment has ended more than 6 months; 12) have conducted previous surgery patients required to study treatment was started more than four weeks, and the patient had recovered; 13) have an intact uterus in women prior to enrollment in the study must have a negative pregnancy test result (unless it is already 24 months of amenorrhea) within 28 days. If the pregnancy test from the first administration more than seven days, urine pregnancy test is required for authentication (less than 7 days before the first dose); 14) previous to biological agents, particularly E.coli genetically engineered products without serious allergic reactions; 15) signed informed consent.

Entity relations:
- Has_qualifier("non-small cell lung cancer", "wild-type EGFR")
- Has_qualifier("non-small cell lung cancer", "ALK-negative")
- Has_qualifier("non-small cell lung cancer", "histologically confirmed")
- Has_value("IASLC2009 new TNM staging", "stage <U+2162>B or <U+2163>")
- AND("lung cancer", "IASLC2009 new TNM staging")
- Has_index("after 1 year of lung cancer resection", "lung cancer resection")
- Has_qualifier("lung cancer", "untreated")
- Has_temporal("lung cancer", "after 1 year of lung cancer resection")
- Has_multiplier("evaluable lesions", "at least one")
- Has_value("longest diameter", "at least 10mm")
- AND("spiral CT", "longest diameter")
- AND("regular CT", "longest diameter")
- Has_value("longest diameter", "at least 20mm")
- Has_value("aged", "18 to 75 years")
- Has_value("ECOG PS", "0 or 1")
- Has_temporal("expected survival", "at least 3 months")
- Has_value("platelet count", "at least 100×10^9/L")
- Has_value("hemoglobin", "at least 9 g/dL")
- Has_value("absolute neutrophil count (ANC)", "at least 2×10^9/L")
- Subsumes("adequate hematological function", "absolute neutrophil count (ANC)")
- Has_value("total bilirubin", "less than upper limit of normal (ULN)")
- Has_value("ALT", "less than 2.5 times upper limit of normal (ULN)")
- Has_value("AST", "less than 2.5 times upper limit of normal (ULN)")
- Has_value("alkaline phosphatase", "less than 5 times the upper limit of normal (ULN)")
- Has_value("serum creatinine", "less than upper limit of normal (ULN)")
- Has_value("calculated creatinine clearance", "at least 60 mL/min")
- Has_value("ECG", "normal")
- Has_negation("non-healing wounds on the body", "no")
- Subsumes("adequate renal function", "serum creatinine")
- Subsumes("adequate liver function", "total bilirubin")
- Has_negation("anticancer drugs", "not received")
- Has_qualifier("chemotherapy", "adjuvant")
- AND("chemotherapy", "non-metastatic tumors")
- Has_temporal("chemotherapy", "ended more than 6 months")
- Has_temporal("non-metastatic tumors", "previous")
- Subsumes("adequate hematological function", "platelet count")
- Subsumes("adequate hematological function", "hemoglobin")
- Subsumes("adequate liver function", "AST")
- Subsumes("adequate liver function", "ALT")
- Subsumes("adequate liver function", "alkaline phosphatase")
- OR("untreated", "relapsed")
- OR("Male", "female")
- OR("serum creatinine", "calculated creatinine clearance")
- OR("adjuvant", "neoadjuvant")
- OR("anticancer drugs", "chemotherapy")